下列對於標準誤（standard error）的敘述何者錯誤？
A. 標準誤可以描述樣本平均值間之變異情形
B. 樣本數增加，則標準誤變小
C. 標準誤不可能大於標準差
D. 樣本數固定，當標準差增加時，標準誤減小

正確答案：D. 樣本數固定，當標準差增加時，標準誤減小